Clinical trial exclusion criterion:
Hemodynamic instability;

Annotated entities:
- Condition: "Hemodynamic instability"